Señale la respuesta INCORRECTA sobre lo que se expone en la Carta de Ottawa:
1. Dispone la equidad como requisito previo a la salud.
2. La salud se contempla como el objetivo de la vida.
3. Entre sus acciones de promoción de la salud implica elaborar una política pública saludable.
4. Dispone de tres estrategias: abogar, mediar y capacitar.

Respuesta correcta: 2. La salud se contempla como el objetivo de la vida.